α酮戊二酸脫氫酶（α-ketoglutarate dehydrogenase）為檸檬酸循環（citric acid cycle）調控酵素（ regulatory enzyme）之一，其酵素活性可受到下列何物之抑制？
A. AMP
B. ADP
C. NAD+
D. 琥珀醯輔酶 A（succinyl-CoA）

正確答案：D. 琥珀醯輔酶 A（succinyl-CoA）